Silent Allosteric Modulation of mGluR5 is a form of treatment for what disease?

silent allosteric modulation of mGluR5 has promise as a disease-modifying AD intervention with a broad therapeutic window.